Clinical trial exclusion criterion:
11. Known or suspected allergy/hypersensitivity to any agent given in the course of this trial.

Annotated entities:
- Condition: "hypersensitivity"
- Condition: "allergy"
- Mood: "Known"
- Mood: "suspected"
- Drug: "agent given in the course of this trial"
- Post-eligibility: "Known or suspected allergy/hypersensitivity to any agent given in the course of this trial"